Clinical trial inclusion criterion:
BMI < 40;

Entity relations:
- Has_value("BMI", "< 40")